有關全身性紅斑狼瘡（systemic lupus erythematosus），下列敘述何者錯誤？
A. 女性多於男性
B. 臉上多有蝴蝶斑（butterfly rash）
C. 血清抗核抗體（antinuclear antibody）為陽性
D. 應多曬太陽，以強化免疫力

正確答案：D. 應多曬太陽，以強化免疫力